Clinical trial exclusion criterion:
Pregnancy or lactation

Annotated entities:
- Condition: "lactation"
- Condition: "Pregnancy"